Clinical trial exclusion criterion:
contraindication for any medication or substance used in survey protocol

Entity relations:
- AND("contraindication", "medication used in survey protocol")
- OR("medication used in survey protocol", "substance used in survey protocol")